肩難產的定義，是胎頭娩出後至少幾分鐘以上肩膀仍無法娩出？
A. 1 分鐘
B. 2 分鐘
C. 3 分鐘
D. 4 分鐘

正確答案：A. 1 分鐘